Clinical trial inclusion criterion:
Patient is able and willing to follow protocol requirements.

Annotated entities:
- Post-eligibility: "Patient is able and willing to follow protocol requirements"